Clinical trial inclusion criterion:
ASA I-IV Age 55 or older Scheduled for operative repair of isolated intertrochanteric hip fracture

Annotated entities:
- Measurement: "ASA"
- Value: "I-IV"
- Person: "Age"
- Value: "55 or older"
- Mood: "Scheduled for"
- Procedure: "operative repair"
- Qualifier: "isolated"
- Condition: "intertrochanteric hip fracture"
- Multiplier: "isolated"
- Line: "Scheduled for operative repair of isolated intertrochanteric hip fracture"
- Line: "Age 55 or older"
- Line: "ASA I-IV"